Drug abuse

The above is a clinical trial exclusion criterion. Annotated with entity spans:
[Condition: Drug abuse]